有關糖尿病與精神疾病的關聯性，下列何者錯誤？
A. 許多抗精神病藥物的長期服用可能引發糖尿病
B. 與糖尿病共病之憂鬱症其致病機轉及治療原則與無生理疾病共病的憂鬱症類似
C. 心理壓力、挫折、孤獨等高壓力情境時常會造成飲食控制的改變，進而影響到血糖的控制
D. 低血糖可能造成焦慮、意識混亂、行為混亂等症狀

正確答案：B. 與糖尿病共病之憂鬱症其致病機轉及治療原則與無生理疾病共病的憂鬱症類似